陳先生是一位 53 歲之牧場工人，到院 4 小時前遭百步蛇咬傷右足背，急診處曾給與 12 劑抗毒蛇血清，在外科加護病房中發現右小腿皮膚成暗紫色、極度腫脹、右足冰冷、足背動脈微弱，測量腔室壓力（compartment pressure）約 70 mmHg，緊急進行筋膜切開及清創手術，3 週後病人從呼吸衰竭及腎衰竭中恢復，右小腿內、外側各有一約 30 公分長、10 公分寬、佈滿鮮紅色肉芽組織之開放性傷口。下列何種傷口處置最為適當？
A. 直接縫合
B. 裂層植皮手術（split thickness skin graft）
C. 全層植皮手術（full thickness skin graft）
D. 游離皮瓣移植（free flap transplantation）

正確答案：B. 裂層植皮手術（split thickness skin graft）